severe liver dysfunction (Child-Pugh Score C)

The above is a clinical trial exclusion criterion. Annotated with entity spans:
[Qualifier: severe] [Condition: liver dysfunction] ([Measurement: Child-Pugh Score] [Value: C])